Clinical trial exclusion criterion:
Use of prescribed stimulants (such as amphetamine or dextroamphetamine containing medications) is exclusionary in the 2 weeks prior to the initial screen (P1) visit and prohibited throughout the study. Participants who take these medications will be asked to discontinue them for a minimum of 2 weeks before the Preliminary Screening Period.

Entity relations:
- Subsumes("prescribed stimulants", "amphetamine")
- Has_temporal("prescribed stimulants", "in the 2 weeks prior to the initial screen (P1) visit")
- OR("amphetamine", "dextroamphetamine")